Clinical trial exclusion criterion:
previous PCI in the target vessel

Entity relations:
- Has_temporal("PCI", "previous")
- Has_qualifier("PCI", "target vessel")
- Has_qualifier("PCI", "target vessel")